Clinical trial exclusion criterion:
Current use of any active systemic medication for chronic atopic dermatitis within one month

Annotated entities:
- Condition: "chronic atopic dermatitis"
- Temporal: "within one month"
- Drug: "systemic medication"
- Temporal: "active"